¿Por qué se elimina el oxígeno en polarografía?:
1. Porque reacciona con el mercurio.
2. Porque perjudica al electrodo de referencia.
3. Porque origina un par de ondas polarográficas.
4. Porque da lugar a reacciones químicas acopladas.

Respuesta correcta: 3. Porque origina un par de ondas polarográficas.